Clinical trial exclusion criteria:
Subjects with hypersensitivity reaction to Statin and Ezetimibe
Subjects with severe kidney disease
Subjects with HIV positive result at the screening
Pregnant or breast-feeding subjects
Subjects with taking any medication affecting level of LDL (Fenofibrate, Omega 3 fatty aicd etc.)
Insulin-treated Subjects
Other exclusions applied

Annotated entities:
- Condition: "hypersensitivity"
- Drug: "Statin"
- Drug: "Ezetimibe"
- Qualifier: "severe"
- Condition: "kidney disease"
- Condition: "HIV positive"
- Temporal: "at the screening"
- Condition: "Pregnant"
- Condition: "breast-feeding"
- Procedure: "LDL"
- Drug: "Fenofibrate"
- Drug: "medication"
- Condition: "affecting"
- Drug: "Omega 3 fatty aicd"
- Drug: "Insulin"
- Non-representable: "Other exclusions applied"